下列何種藥物對於化學治療劑引起的噁心、嘔吐，有很好的預防作用？
A. buspirone
B. ketanserin
C. tegaserod
D. ondansetron

正確答案：D. ondansetron